Underlying chronic liver disease (hemochromatosis, liver cell carcinoma, autoimmune liver disease, liver cirrhosis, chronic viral hepatitis)

The above is a clinical trial exclusion criterion. Annotated with entity spans:
Underlying [Condition: chronic liver disease] ([Condition: hemochromatosis], [Condition: liver cell carcinoma], [Condition: autoimmune liver disease], [Condition: liver cirrhosis], [Condition: chronic viral hepatitis])